嗜肺性退伍軍人桿菌（Legionella pneumophila）為新興傳染病原之一，會造成許多流行性及散發性的感染症。此細菌主要是如何傳播的？
A. 由病媒傳染給人
B. 由人直接傳染給人
C. 由動物傳染給人
D. 由空氣微粒傳染給人

正確答案：D. 由空氣微粒傳染給人